Clinical trial exclusion criterion:
Oxygen therapy: Subjects receiving treatment with long-term oxygen therapy (LTOT) or nocturnal oxygen therapy required for greater than 12 hours a day. Oxygen prn use (i.e. <=12 hours per day) is not exclusionary.

Annotated entities:
- Procedure: "long-term oxygen therapy (LTOT)"
- Procedure: "nocturnal oxygen therapy"
- Multiplier: "greater than 12 hours a day"
- Grammar_Error: "Oxygen prn use (i.e. <=12 hours per day) is not exclusionary."